一位30歲女性，生產完兩個月，目前正在餵母乳。主訴為雙手麻痺，理學檢查發現雙手指第一指至第三指指尖感覺較遲鈍， Tinel's sign在雙手腕處呈陽性，Phalen's test亦為陽性，這位病人的臨床診斷最有可能為何？
A. 橈神經病變
B. 尺神經病變
C. 正中神經病變
D. 頸神經根病變

正確答案：C. 正中神經病變